下列何者不是顯影劑（contrast media）引致急性腎衰竭的危險因子？
A. 脫水
B. 糖尿病腎病變
C. 高劑量顯影劑
D. 肥胖症

正確答案：D. 肥胖症